Clinical trial inclusion criterion:
Available for all visits scheduled in this study.

Annotated entities:
- Observation: "Available for all visits"
- Qualifier: "scheduled in this study"